Clinical trial exclusion criterion:
Open surgery;

Annotated entities:
- Procedure: "Open surgery"